Clinical trial inclusion criterion:
Any allogeneic stem cell transplant recipient = 14 years of age and = 60 years of age

Entity relations:
- Has_value("age", "= 60 years")
- Has_value("age", "= 14 years")